Las fuentes de dificultad de orden físico, psicológico, sociológico y relacionadas con falta de conocimiento y que causan dependencia a las personas, fueron clasificadas por:
1. D. Orem.
2. V. Henderson.
3. H. Peplau.
4. C. Roy.

Respuesta correcta: 2. V. Henderson.